Clinical trial inclusion criterion:
Cytologically proven acute lymphoblastic leukemia (ALL)

Entity relations:
- Subsumes("acute lymphoblastic leukemia", "ALL")
- Has_qualifier("acute lymphoblastic leukemia", "Cytologically proven")